Smokers

The above is a clinical trial exclusion criterion. Annotated with entity spans:
[Condition: Smokers]